Clinical trial inclusion criterion:
Subjects must have the ability to understand and the willingness to sign a written informed consent document.

Annotated entities:
- Non-query-able: "Subjects must have the ability to understand and the willingness to sign a written informed consent document"